Clinical trial inclusion criterion:
Previous post-exposure prophylaxis (PEP) use during the last 12 months.

Entity relations:
- Subsumes("post-exposure prophylaxis use", "PEP")